Clinical trial inclusion criteria:
Complex kidney stone (staghorn calculi GUYS III and IV)

Annotated entities:
- Condition: "Complex kidney stone"
- Condition: "staghorn calculi"
- Measurement: "GUYS"
- Value: "III and IV"